Acude a la consulta un hombre de 67 años, exfumador, con el diagnóstico de EPOC grave (índice multidimensional BODE 5, FEV1 38%, índice de masa corporal 23, índice de disnea según la escala mMRC 3, distancia recorrida en la prueba de los 6 minutos marcha 260 m) que ha tenido 3 ingresos hospitalarios por exacerbación de su EPOC en los últimos 7 meses. Además presenta antecedentes de HTA, cardiopatía isquémica con IAM hace 5 años y claudicación intermitente. En la exploración clínica destaca una disminución del murmullo vesicular con sibilancias espiratorias en ambos campos pulmonares y una saturación en la oximetría del 88%. ¿Cuál de las siguientes estrategias terapéuticas NO sería recomendable para este paciente?:
1. Ajuste del tratamiento inhalado con broncodilatadores de larga duración combinando anticolinérgicos y beta-2 adrenérgicos con glucocorticoides inhalados.
2. Iniciar pauta de glucocorticoides orales durante 6 meses para el control de las exacerbaciones.
3. Comprobar que el paciente realiza correctamente la técnica inhalatoria.
4. Iniciar pauta de oxigenoterapia crónica domiciliaria.

Respuesta correcta: 2. Iniciar pauta de glucocorticoides orales durante 6 meses para el control de las exacerbaciones.